Clinical trial exclusion criterion:
Patients with severe emphysema, pulmonary vasculitis, or a history of pulmonary emboli.

Annotated entities:
- Qualifier: "severe"
- Condition: "emphysema"
- Condition: "pulmonary vasculitis"
- Condition: "pulmonary emboli"